How can B-cells transdifferentiate into macrophages?

Human cancer cells can be induced by C/EBPα to transdifferentiate into seemingly normal cells at high frequencies . This provides a proof of principle for a potential new therapeutic strategy for treating B cell malignancies . Inflammatory macrophages transdifferentiate into myofibroblasts during renal fibrosis .